Clinical trial exclusion criterion:
Abnormal coagulation profile

Annotated entities:
- Value: "Abnormal"
- Measurement: "coagulation profile"
- Condition: "Abnormal coagulation profile"